Clinical trial inclusion criterion:
for which treatment with dimethyl-fumarate has been prescribed

Annotated entities:
- Drug: "dimethyl-fumarate"